Clinical trial exclusion criterion:
History of significant drug hypersensitivity or anaphylaxis.

Entity relations:
- Has_qualifier("drug anaphylaxis", "significant")
- Has_qualifier("drug hypersensitivity", "significant")
- Has_temporal("drug anaphylaxis", "History")
- Has_temporal("drug hypersensitivity", "History")
- OR("drug hypersensitivity", "drug anaphylaxis")